Clinical trial exclusion criterion:
Have had a prior catheter ablation procedure for VT

Entity relations:
- AND("catheter ablation procedure", "VT")